發生下列那一項事件時，有最高的機率表示流感已經發生大突變，有可能是全新的全世界大流行病 毒（pandemic virus）？
A. 某養雞場出現死亡率 80%的雞瘟，培養出 H5N2 亞型禽流感病毒，雞場 5 位工作人員中有 1 位有發燒症狀
B. 印尼有兩兄弟死亡，兩位病患身上與其家中養的雞隻均培養出 H5N1 亞型禽流感病毒
C. 某醫院通報兩位無地緣關係的流感重症病患，兩位均併發腦炎且都培養出 H1N1 亞型 A 型流感病毒
D. 某醫院收治一位類流感病患，該病患死亡，後來有 18 名醫護人員陸續發病，病毒均培養出 H2N3 亞型 A 型流感病毒

正確答案：D. 某醫院收治一位類流感病患，該病患死亡，後來有 18 名醫護人員陸續發病，病毒均培養出 H2N3 亞型 A 型流感病毒